6) no antidepressant medications or clinically able to discontinue medications,

The above is a clinical trial inclusion criterion. Annotated with entity spans:
[Parsing_Error: 6)] [Negation: no] [Drug: antidepressant] medications or [Condition: clinically able to discontinue medications],